Treated hypertensive patients with an average daytime ambulatory blood pressure measurement (ABPM) <150/95mmHg on stable doses of one or more antihypertensive medication (at least one of which should be; an ACE inhibitor, angiotensin receptor blocker or diuretic) for 3 months, or untreated hypertensive patients with an average daytime ABPM =135/85 but <150/95.

The above is a clinical trial inclusion criterion. Annotated with entity spans:
[Qualifier: Treated] [Condition: hypertensive] patients with an [Measurement: average daytime ambulatory blood pressure measurement (ABPM)] [Value: <150/95mmHg] on [Qualifier: stable doses] of [Multiplier: one or more] [Drug: antihypertensive medication] ([Multiplier: at least one] of which should be; an [Drug: ACE inhibitor], [Drug: angiotensin receptor blocker] or [Drug: diuretic]) [Temporal: for 3 months], or [Qualifier: untreated] [Condition: hypertensive patients] with an [Measurement: average daytime ABPM] [Value: =135/85 but <150/95].